下列那一種白血病對於酪胺酸激 抑制劑（酶	tyrosine kinase inhibitor）如 Glivec 治療最有效？
A. 急性骨髓性白血病，第 3 型
B. 慢性骨髓性白血病，費城染色體陽性
C. 慢性淋巴性白血病，ZAP-70 陽性
D. \ 骨髓分化不良症候群，第 7 對染色體缺損

正確答案：B. 慢性骨髓性白血病，費城染色體陽性